Unexplained abdominal pain

The above is a clinical trial exclusion criterion. Annotated with entity spans:
[Qualifier: Unexplained] [Condition: abdominal pain]